Clinical trial inclusion criterion:
Male or female between, and including, 6-12 weeks (42 to 90 days) of age at the time of the first vaccination.

Entity relations:
- Subsumes("between 6-12 weeks", "between 42 to 90 days")
- Has_value("of age", "between 6-12 weeks")
- Has_temporal("of age", "at the time of the first vaccination")